Oral hypoglycemic or hormonal therapy either currently or in the preceding 3 months.

The above is a clinical trial exclusion criterion. Annotated with entity spans:
[Qualifier: Oral] [Procedure: hypoglycemic] or [Procedure: hormonal therapy] either currently or in the [Temporal: preceding 3 months].